Clinical trial exclusion criterion:
Pregnant woman or lactating woman.

Entity relations:
- OR("Pregnant", "lactating")
- OR("woman", "lactating")